下列那一個胺基酸在酸鹼值7.0的電泳（electrophoresis）過程中，朝向陽極移動的速率最快？
A. 丙氨酸（alanine）
B. 離胺酸（lysine）
C. 麩胺醯胺（glutamine）
D. 天冬氨酸（aspartic acid）

正確答案：D. 天冬氨酸（aspartic acid）